下列那一項喉軟骨的發育與第四及第六對咽弓（pharyngeal arch）的軟骨無關？
A. 甲狀軟骨（thyroid cartilage）
B. 會厭軟骨（epiglottis）
C. 杓狀軟骨（arytenoid cartilage）
D. 環狀軟骨（cricoid cartilage）

正確答案：B. 會厭軟骨（epiglottis）